Clinical trial exclusion criterion:
Decreased blood pressure, causing symptoms (symptomatic hypotension),

Entity relations:
- Has_qualifier("blood pressure", "Decreased")
- AND("blood pressure", "symptoms")
- Has_qualifier("hypotension", "symptomatic")
- Subsumes("blood pressure", "hypotension")